Clinical trial exclusion criterion:
Height < 4' 11"

Entity relations:
- Has_value("Height", "< 4' 11"")